Signs of (RV) failure as indicated by NT-proBNP levels >600 pg/ml at baseline.

The above is a clinical trial inclusion criterion. Annotated with entity spans:
Signs of ([Condition: RV) failure] as indicated by [Measurement: NT-proBNP levels] [Value: >600 pg/ml] at baseline.